Clinical trial inclusion criterion:
Platelet count greater than or equal to 40,000/mm^3

Entity relations:
- Has_value("Platelet count", "greater than or equal to 40,000/mm^3")